Clinical trial exclusion criterion:
Subjects who will be inaccessible due to geographic or social factors during treatment or follow-up

Annotated entities:
- Observation: "inaccessible"
- Temporal: "during treatment or follow-up"
- Reference_point: "treatment"
- Reference_point: "follow-up"